Clinical trial exclusion criterion:
More than 4 previous embryo transfers

Entity relations:
- Has_temporal("embryo transfers", "previous")
- Has_multiplier("embryo transfers", "More than 4")